Clinical trial inclusion criterion:
Moderate to very severe lesions located in large folds

Entity relations:
- Has_qualifier("lesions", "very severe")